Clinical trial inclusion criterion:
Patient on hemodialysis treatment for at least 1 month

Entity relations:
- Has_temporal("hemodialysis", "at least 1 month")